Clinical trial exclusion criterion:
Awake resting oxyhemoglobin saturation <89%

Annotated entities:
- Measurement: "oxyhemoglobin saturation"
- Qualifier: "resting"
- Qualifier: "Awake"
- Value: "<89%"